Discharge from the operating hospital to an ICU at another hospital

The above is a clinical trial exclusion criterion. Annotated with entity spans:
[Observation: Discharge] from the [Visit: operating hospital] to an [Visit: ICU] at [Qualifier: another] [Visit: hospital]